Clinical trial exclusion criterion:
Has a known history of corneal hypoesthesia (reduced corneal sensitivity)

Entity relations:
- Subsumes("corneal hypoesthesia", "reduced corneal sensitivity")
- Has_temporal("corneal hypoesthesia", "history")